antidiabetic treatment with either diet, metformin, DPP4, GLP1, pioglitazone, acarbose, or respective combinations

The above is a clinical trial inclusion criterion. Annotated with entity spans:
[Procedure: antidiabetic treatment] with either [Observation: diet], [Drug: metformin], [Drug: DPP4], [Drug: GLP1], [Drug: pioglitazone], [Drug: acarbose], or respective combinations